Clinical trial inclusion criterion:
De novo kidney transplants

Annotated entities:
- Procedure: "kidney transplants"
- Qualifier: "De novo"